Clinical trial exclusion criterion:
Complicated (effusion, empyema or abscess) pneumonia, including tuberculosis

Entity relations:
- Subsumes("Complicated pneumonia", "tuberculosis")
- Subsumes("Complicated pneumonia", "empyema")
- AND("empyema", "abscess")
- OR("effusion", "empyema", "abscess")